Clinical trial exclusion criterion:
Use of any of the prohibited medications listed in protocol.

Annotated entities:
- Context_Error: "Use of any of the prohibited medications listed in protocol."
- Drug: "prohibited medications listed in protocol"